Clinical trial inclusion criterion:
Apgar score at 5 minutes >7

Entity relations:
- Has_value("Apgar score", ">7")
- Has_temporal("Apgar score", "at 5 minutes")